Clinical trial exclusion criterion:
Patients < 18 years of age and >70 years of age

Entity relations:
- Has_value("age", "< 18 years")
- Has_value("age", ">70 years")
- OR("age", "age")